Clinical trial exclusion criterion:
Indication for emergent cesarean or known fetal anomaly

Annotated entities:
- Condition: "Indication"
- Procedure: "emergent cesarean"
- Condition: "fetal anomaly"